Clinical trial inclusion criteria:
diabetes mellitus type 1

Annotated entities:
- Condition: "diabetes mellitus type 1"